Minor surgical procedure (e.g., open biopsy) <=7 days before first dose of study treatment, or not yet recovered from prior minor surgery Note: uncomplicated placement of vascular access device, fine needle aspiration, thoracocentesis or paracentesis >=3 days prior to first dose of study treatment is acceptable.

The above is a clinical trial exclusion criterion. Annotated with entity spans:
[Procedure: Minor surgical procedure] (e.g., [Procedure: open biopsy]) [Temporal: <=7 days before first dose of study treatment], or [Negation: not yet] [Condition: recovered] from [Temporal: prior] [Procedure: minor surgery] Note: uncomplicated placement of vascular access device, fine needle aspiration, thoracocentesis or paracentesis >=3 days prior to first dose of study treatment is acceptable.